Clinical trial exclusion criteria:
Age > 18 Years
Physician discretion
Septic or hypovolemic shock
Signs of life-threatening cerebral edema or multi-organ failure upon presentation to the emergency room or pediatric intensive care unit
Enrollment time more than 1 hr since arrival to emergency room or PICU
Pregnancy

Annotated entities:
- Person: "Age"
- Value: "> 18 Years"
- Non-query-able: "Physician discretion"
- Condition: "Septic shock"
- Condition: "hypovolemic shock"
- Condition: "cerebral edema"
- Condition: "multi-organ failure"
- Mood: "Signs of"
- Qualifier: "life-threatening"
- Visit: "emergency room"
- Visit: "pediatric intensive care unit"
- Temporal: "upon presentation to the emergency room or pediatric intensive care unit"
- Reference_point: "presentation to the emergency room or pediatric intensive care unit"
- Observation: "Enrollment"
- Temporal: "more than 1 hr since arrival to emergency room or PICU"
- Visit: "emergency room"
- Visit: "PICU"
- Reference_point: "arrival to emergency room or PICU"
- Condition: "Pregnancy"